Clinical trial inclusion criterion:
Ability to speak and understand English

Annotated entities:
- Observation: "Ability to speak English"
- Observation: "Ability to understand English"